Clinical trial exclusion criteria:
Unstable vital sign before surgery
Severe pulmonary disease requiring consistent treatment
Illiterate
Pregnancy

Annotated entities:
- Qualifier: "Unstable"
- Condition: "vital sign"
- Temporal: "before surgery"
- Procedure: "surgery"
- Reference_point: "surgery"
- Condition: "pulmonary disease"
- Procedure: "consistent treatment"
- Mood: "requiring"
- Qualifier: "Severe"
- Observation: "Illiterate"
- Condition: "Pregnancy"